Clinical trial inclusion criterion:
Liver biopsy within 2 years of Screening showing absence of cirrhosis

Entity relations:
- Has_negation("cirrhosis", "absence")
- Has_temporal("Liver biopsy", "within 2 years of Screening")
- AND("Liver biopsy", "cirrhosis")